Clinical trial inclusion criterion:
Healthy patients age 18 and older

Entity relations:
- Has_value("age", "18 and older")